5. Agrees to use double-barrier contraception during the study and for 30 days after discontinuation of study medication. Acceptable double-barrier methods are: male condom with spermicide; male condom with diaphragm; diaphragm containing spermicide plus additional intra-vaginal spermicide;

The above is a clinical trial inclusion criterion. Annotated with entity spans:
[Parsing_Error: 5.] [Non-query-able: Agrees to use double-barrier contraception during the study and for 30 days after discontinuation of study medication.] [Parsing_Error: Acceptable double-barrier methods are: male condom with spermicide; male condom with diaphragm; diaphragm containing spermicide plus additional intra-vaginal spermicide;]